Clinical trial exclusion criterion:
Patients currently taking benzodiazepine drugs

Annotated entities:
- Procedure: "benzodiazepine drugs"
- Temporal: "currently"